Las células granulares o yuxtaglomerulares de la nefrona secretan:
1. Angiotensina I.
2. Renina.
3. Angiotensinógeno.
4. Aldosterona.
5. Vasopresina.

Respuesta correcta: 2. Renina.